Clinical trial exclusion criterion:
Participation in another clinical trial within the past 30 days.

Annotated entities:
- Non-query-able: "Participation in another clinical trial within the past 30 days."